Clinical trial exclusion criterion:
Known levetiracetam allergy

Annotated entities:
- Drug: "levetiracetam"
- Condition: "allergy"